下列關於膽囊收縮素（cholecystokinin）之敘述，何者正確？
A. 促進胃排空（gastric emptying）作用
B. 刺激胰臟分泌富含酵素的胰液
C. 受迷走神經（vagus nerve）刺激而分泌
D. 受十二指腸壁擴張而分泌

正確答案：B. 刺激胰臟分泌富含酵素的胰液